Clinical trial inclusion criteria:
Patients needed to pericardiocentesis during RFCA for paroxysmal or persistent atrial fibrillation.

Annotated entities:
- Procedure: "pericardiocentesis"
- Temporal: "during RFCA"
- Reference_point: "RFCA"
- Procedure: "RFCA"
- Qualifier: "paroxysmal"
- Qualifier: "persistent"
- Condition: "atrial fibrillation"